Clinical trial exclusion criterion:
4. An ulcer positive for β-hemolytic streptococci upon culture

Annotated entities:
- Parsing_Error: "4."
- Condition: "ulcer"
- Qualifier: "positive for β-hemolytic streptococci"